Clinical trial inclusion criterion:
Has an indication for implantation of a single or dual chamber ICD or CRT-D system in their respective geography

Entity relations:
- Has_context("dual chamber ICD implantation of a", "indication")
- OR("dual chamber ICD implantation of a", "chamber ICD implantation of a single", "CRT-D system implantation of a")